Las células de Purkinje:
1. Excitan neuronas del núcleo ventral-anterior talámico.
2. Inhiben neuronas de núcleos cerebelosos profundos.
3. Excitan neuronas de corteza motora primaria.
4. Inhiben motoneuronas espinales.

Respuesta correcta: 2. Inhiben neuronas de núcleos cerebelosos profundos.